一位 30 歲女性病患，自 3 樓跌落地面，經 119 救護車送達一家地區醫院急診室。到院時病患很躁動，血壓 80/50 mmHg，心跳 130/min，呼吸 30/min。由於該院沒有處理嚴重外傷的能力，必須將病患轉送到外傷中心。請問在轉送前，下列那項處置不適當？
A. 應立即確認呼吸道通暢無慮
B. 給予氧氣
C. 給予大量輸液及輸血，必須將病患收縮壓維持在 120 mmHg 以上才能轉送
D. 與接受轉診的醫師直接聯繫

正確答案：C. 給予大量輸液及輸血，必須將病患收縮壓維持在 120 mmHg 以上才能轉送